known allergies for tranexamic acid or any other substance in Exacyl

The above is a clinical trial exclusion criterion. Annotated with entity spans:
known [Condition: allergies] for [Drug: tranexamic acid] or any other substance in [Drug: Exacyl]